Clinical trial inclusion criterion:
Renal impairment (AKIN stage = 1) or acute and/or chronic renal replacement therapy

Entity relations:
- Has_value("AKIN stage", "= 1")
- Subsumes("Renal impairment", "AKIN stage")
- Has_qualifier("renal replacement therapy", "acute")
- OR("acute", "chronic")
- OR("Renal impairment", "renal replacement therapy")